Si el potencial normal de reducción del par Zn2+/Zn es -0,76 V:
1. Las disoluciones acuosas de Zn2+ a pH=0 desprenden oxígeno.
2. Poniendo Zn metálico en disolución acuosa a pH=0 se desprende oxígeno.
3. Las disoluciones acuosas de Zn2+ a pH=0 desprenden hidrógeno.
4. Poniendo Zn metálico en disolución acuosa a pH=0 se desprende hidrógeno.
5. El Zn2+ dismuta en disolución acuosa a pH=0.

Respuesta correcta: 4. Poniendo Zn metálico en disolución acuosa a pH=0 se desprende hidrógeno.